下列敘述，何者錯誤？
A. 後腹腔出血（retroperitoneal hemorrhage）會造成手術後麻痺性腸阻塞（paralytic ileus）
B. 腸套疊（intussusception）是手術後發生早期（術後 30 天內）機械性小腸阻塞（mechanical intestinal obstruction）最常見的原因
C. 封閉迴路（closed loop）的小腸阻塞建議再次剖腹探查
D. 腹部電腦斷層攝影（abdominal computed tomography）有助於診斷腸阻塞的原因

正確答案：B. 腸套疊（intussusception）是手術後發生早期（術後 30 天內）機械性小腸阻塞（mechanical intestinal obstruction）最常見的原因